Patients with a clinically significant disease (chronic, recurrent or active).

The above is a clinical trial exclusion criterion. Annotated with entity spans:
Patients with a [Qualifier: clinically significant] [Condition: disease] ([Qualifier: chronic], [Qualifier: recurrent] or [Qualifier: active]).